下列抗血小板凝集藥物，何者作用機轉為阻斷glycoprotein IIb/IIIa？
A. clopidogrel
B. dipyridamole
C. abciximab
D. aspirin

正確答案：C. abciximab